Clinical trial exclusion criterion:
Significant preoperative pain requiring treatment with high doses of opioids (more than 6-8 Norco tablets or equivalence per day) or recent history of opioid abuse

Annotated entities:
- Condition: "preoperative pain"
- Qualifier: "Significant"
- Mood: "requiring"
- Multiplier: "high doses"
- Drug: "opioids"
- Multiplier: "more than 6-8 per day"
- Drug: "Norco tablets"
- Drug: "equivalence"
- Temporal: "recent"
- Temporal: "history"
- Condition: "opioid abuse"